Clinical trial inclusion criterion:
Hyperfluorescent areas on indocyanine green angiography (ICGA).

Annotated entities:
- Condition: "Hyperfluorescent areas"
- Procedure: "indocyanine green angiography (ICGA)"